3. Antihypertensives: nifedipine

The above is a clinical trial exclusion criterion. Annotated with entity spans:
[Parsing_Error: 3.] Antihypertensives: [Drug: nifedipine]